Clinical trial inclusion criterion:
Scheduled to electively undergo open-laparotomy.

Entity relations:
- Has_mood("open-laparotomy", "electively")
- Has_mood("open-laparotomy", "Scheduled")